一位 14 歲的女生之前沒有任何病史，這次因為連續五天的發燒和呼吸困難來診。在病房時懷疑感染，所以分別做了血液、尿液和痰液的培養，但是都沒有任何陽性的結果。也給予廣效性抗生素，但是患者仍持續發燒。肺部的 X-光檢查可以發現間質性浸潤形式的發炎。下列何種檢查對診斷較無幫助？
A. 結核菌素（Tuberculin）檢查
B. 肺部電腦斷層攝影
C. 抗核抗體（ANA）
D. 周邊血液抹片

正確答案：B. 肺部電腦斷層攝影